有一位糖尿病酮酸中毒（diabetic ketoacidosis）之病童，在其他醫院治療了一天，因神智還未回復而轉至本院。在急診室中病童突然產生抽筋（seizure），檢查發現兩側瞳孔大小不一。則此時最好之處置為快速給予：
A. 20 mL/kg 0.9% NaCl
B. regular insulin 0.1 U/kg
C. 1：10000 epinephrine 0.1 cc/kg
D. l 10 mL/kg 20% mannitol

正確答案：D. l 10 mL/kg 20% mannitol